Clinical trial exclusion criterion:
Cardiac surgery already scheduled in the next three months

Entity relations:
- Has_mood("Cardiac surgery", "scheduled")
- Has_temporal("Cardiac surgery", "in the next three months")
- Has_index("in the next three months", "three months")